What is Legg-Calvé-Perthes Disease

Legg-Calve-Perthes disease is  idiopathic avascular necrosis of the hip, usually occurring in pediatric populations.